有關急性細菌性前列腺炎之敘述，下列何者錯誤？
A. 通常細菌是由尿道進入或是因為感染的尿液回流至前列腺小管（prostatic ducts）造成
B. 大人較常見，但是很少見於青春期前的男孩
C. 為了取得急性期時之細菌培養，要進行前列腺按摩，再將解出之尿液或前列腺液送細菌培養
D. 急性期時尿中及血液中之白血球常會上升

正確答案：C. 為了取得急性期時之細菌培養，要進行前列腺按摩，再將解出之尿液或前列腺液送細菌培養